La bilis producida por el hígado se almacena en la vesícula biliar desde donde es secretada al duodeno cuando la musculatura implicada recibe dicha orden en forma de señales hormonales y nerviosas mediadas por:
1. Colecitocinina y la activación simpática betaadrenérgica.
2. Pancreozimina y la activación simpática betaadrenérgica.
3. Secretina y la activación parasimpática.
4. Colecistocinina y la activación parasimpática.
5. Secretina y la activación simpática alfaadrenérgica.

Respuesta correcta: 4. Colecistocinina y la activación parasimpática.